Clinical trial exclusion criteria:
Body mass index (BMI) of 35 kg/m2 or more.
Significant metabolic and endocrine diseases.
Diagnosis of cancer.
Use of steroids or drugs that interfere with the metabolism of estrogen.
Use of any systemic estrogen, progestin, or DHEA in the eight weeks prior to randomization.
Use of alternative therapies or natural products to treat postmenopausal symptoms in the four weeks prior to randomization.
Palpable fibroids or uterine prolapse: Grade 2 or 3.
Cigarette smoking

Annotated entities:
- Measurement: "Body mass index (BMI)"
- Value: "35 kg/m2 or more"
- Condition: "metabolic diseases"
- Condition: "endocrine diseases"
- Condition: "cancer"
- Drug: "steroids"
- Drug: "drugs that interfere with the metabolism of estrogen"
- Drug: "systemic estrogen"
- Drug: "systemic progestin"
- Drug: "DHEA"
- Temporal: "in the eight weeks prior to randomization"
- Procedure: "alternative therapies"
- Drug: "natural products"
- Condition: "postmenopausal symptoms"
- Temporal: "in the four weeks prior to randomization"
- Condition: "Palpable fibroids"
- Condition: "uterine prolapse"
- Measurement: "Grade"
- Value: "2 or 3"
- Condition: "Cigarette smoking"